Clinical trial exclusion criterion:
No one with missing data that are needed for the differential diagnosis, or for selection of the proper therapy arm

Annotated entities:
- Negation: "No"
- Non-query-able: "o one with missing data that are needed for the differential diagnosis, or for selection of the proper therapy arm"